Clinical trial inclusion criterion:
Patient suffering from mild to moderate active proctitis or distal proctosigmoiditis (MAYO score ≥ 3 and ≤ 10) at inclusion based on clinical and endoscopic findings within 6 months before study inclusion.

Annotated entities:
- Condition: "active proctitis"
- Condition: "distal proctosigmoiditis"
- Qualifier: "mild to moderate"
- Measurement: "MAYO score"
- Value: "≥ 3 and ≤ 10"
- Temporal: "within 6 months before study inclusion"
- Reference_point: "study inclusion"
- Temporal: "at inclusion"
- Reference_point: "inclusion"